El método principal para la preparación de βceto ésteres es la reacción conocida como:
1. Síntesis malónica.
2. Síntesis acetoacética.
3. Condensación de Claisen.
4. Reacción de Perkin.
5. Reacción de Hofmann.

Respuesta correcta: 3. Condensación de Claisen.